臺灣最常見的腦中風是那一分類？
A. 腦梗塞（cerebral infarction）
B. 腦內出血（intracerebral hemorrhage）
C. 蜘蛛網膜下出血（subarachnoid hemorrhage）
D. 缺氧性腦病變（hypoxic encephalopathy）

正確答案：A. 腦梗塞（cerebral infarction）